En la cinética de Michaelis-Menten, cuando los valores de [s] son muy inferiores (<1/100) al valor de Km:
1. Estamos en cinética de saturación.
2. La cinética es de orden 1.
3. La Vo es la Vmax.
4. La velocidad es independiente de la [s].
5. Esa situación no se produce nunca.

Respuesta correcta: 2. La cinética es de orden 1.